Clinical trial inclusion criterion:
Diagnosis of functional dyspepsia, based on the Rome IV criteria (2016).

Annotated entities:
- Condition: "functional dyspepsia"
- Measurement: "Rome IV criteria (2016)"